Clinical trial exclusion criterion:
Subject is currently participating or plans to participate in any other investigational device or drug without prior approval from the Sponsor;

Annotated entities:
- Post-eligibility: "Subject is currently participating or plans to participate in any other investigational device or drug without prior approval from the Sponsor"